Clinical trial exclusion criterion:
eGFR <45 ml/min

Entity relations:
- Has_value("eGFR", "<45 ml/min")